Clinical trial exclusion criterion:
Need of renal replacement therapy

Entity relations:
- Has_mood("renal replacement therapy", "Need")